以下有關內毒素（endotoxin）之敘述，何者錯誤？
A. 主要來源為革蘭氏陽性細菌
B. 由細胞壁脂多醣體（LPS）組成
C. 與誘發發炎反應有關
D. 與引發敗血症有關

正確答案：A. 主要來源為革蘭氏陽性細菌